Clinical trial exclusion criterion:
ALP >= 3 x ULN

Entity relations:
- Has_value("ALP", ">= 3 x ULN")